Clinical trial exclusion criterion:
6. History of pneumonitis or interstitial lung disease.

Annotated entities:
- Parsing_Error: "6."
- Condition: "pneumonitis"
- Condition: "interstitial lung disease"
- Temporal: "History"